En la evaluación psicológica las “escalas de apreciación y protocolos de conducta” recogen:
1. Cualquier tipo de conductas producidas en un tiempo establecido de antemano.
2. Un tipo de conducta en un tiempo no establecido.
3. Una conducta previamente especificada en un tiempo establecido de antemano.
4. Un continuo de las conductas tal y como se producen en su ambiente natural, sin sistematización alguna.

Respuesta correcta: 3. Una conducta previamente especificada en un tiempo establecido de antemano.